Clinical trial exclusion criterion:
Infection in or near insertion site of the peripheral nerve catheter

Annotated entities:
- Qualifier: "near insertion site"
- Qualifier: "in insertion site"
- Device: "peripheral nerve catheter"